Preexisting ocular diseases or conditions other than age related cataracts, have contraindications for cataract surgery;

The above is a clinical trial exclusion criterion. Annotated with entity spans:
[Temporal: Preexisting] [Condition: ocular diseases] or [Condition: conditions] [Negation: other than] [Qualifier: age related] [Condition: cataracts], have [Condition: contraindications] for [Procedure: cataract surgery];